History of severe head injury

The above is a clinical trial exclusion criterion. Annotated with entity spans:
[Temporal: History] of [Condition: severe head injury]